下列有關一氧化碳中毒的敘述，何者錯誤？
A. 一氧化碳中毒的症狀為頭痛、噁心，且因缺氧故刺激化學接受體（chemoreceptor）使呼吸加快加深
B. 一氧化碳中毒的患者皮膚可呈櫻桃紅色
C. 一氧化碳中毒時，若體內 70-80%血紅素變成帶"一氧化碳血紅素（COHb）＂則可能致命
D. 治療一氧化碳中毒可用高濃度氧氣或高壓氧

正確答案：A. 一氧化碳中毒的症狀為頭痛、噁心，且因缺氧故刺激化學接受體（chemoreceptor）使呼吸加快加深